Clinical trial inclusion criterion:
Patients with type 2 diabetes mellitus

Annotated entities:
- Condition: "type 2 diabetes mellitus"